Clinical trial inclusion criterion:
At least an average of 4 seizures/week in baseline period.

Annotated entities:
- Condition: "seizures"
- Multiplier: "At least an average of 4 /week"